Clinical trial exclusion criterion:
dementia

Annotated entities:
- Condition: "dementia"